Clinical trial exclusion criterion:
History of renal insufficiency or failure

Annotated entities:
- Condition: "renal insufficiency"
- Condition: "renal failure"